下列何者最無法系統性降低給藥的錯誤（medication error）？
A. 醫師直接利用電腦作醫令輸入
B. 利用電子條碼（bar-coding）掃描作藥品輸入
C. 由專屬人員輸入處方
D. 在加護病房照護團隊中配備藥師

正確答案：C. 由專屬人員輸入處方